Eligible patients must meet the following criteria to be enrolled in the study:

The above is a clinical trial inclusion criterion. Annotated with entity spans:
[Parsing_Error: Eligible patients must meet the following criteria to be enrolled in the study:]